Clinical trial exclusion criterion:
lack of co-operation, e.g. inability to use a PCA (patient controlled analgesia)-device

Entity relations:
- AND("inability to use", "PCA -device")
- Subsumes("lack of co-operation", "inability to use")